下列關於真菌的抵抗力之敘述，何者為錯？
A. 對乾燥、陽光和紫外線抵抗力較強
B. 對一般消毒劑抵抗力較強
C. 耐熱，60℃一小時不會被殺死
D. 對抗細菌性抗生素不敏感

正確答案：C. 耐熱，60℃一小時不會被殺死